Clinical trial exclusion criterion:
GCS less than 15

Annotated entities:
- Measurement: "GCS"
- Value: "less than 15"